依2015年American Heart Association Guidelines執行成人心肺復甦時，應提供的通氣次數及通氣量（潮氣容積），下列敘述何者較不適當？
A. 使用袋瓣面罩（Bag-Valve-Mask）時，成人為每分	通氣10～12次
B. 當插上氣管內管時，成人每次通氣間隔約6秒
C. 當插上氣管內管時，成人的壓胸及通氣比為30：2
D. 維持每次6～7 mL/kg的通氣量

正確答案：C. 當插上氣管內管時，成人的壓胸及通氣比為30：2